ECOG performance status 0-2,Child pugh A or B

The above is a clinical trial inclusion criterion. Annotated with entity spans:
[Measurement: ECOG performance status] [Value: 0-2],[Measurement: Child pugh] [Value: A] or [Value: B]